Clinical trial exclusion criteria:
Uncontrolled medical problems including pulmonary, cardiovascular or orthopedic disease,
Any debilitating disease prior to the SCI that caused exercise intolerance
Premorbid, ongoing major depression or psychosis, altered cognitive status
History of head injury or stroke,
Metal plate in skull
History of seizures
Receiving drugs acting primarily on the central nervous system, which lower the seizure threshold such as antipsychotic drugs (chlorpromazine, clozapine) or tricyclic antidepressants.
Pregnant females, and
Ongoing cord compression or a syrinx in the spinal cord or who suffer from a spinal cord disease such as spinal stenosis, spina bifida or herniated cervical disk.
Uncontrolled medical problems including pulmonary, cardiovascular or orthopedic disease,
Any debilitating disease that causes exercise intolerance
Premorbid, ongoing major depression or psychosis, altered cognitive status
History of head injury or stroke,
Metal plate in skull
History of seizures
Receiving drugs acting primarily on the central nervous system, which lower the seizure threshold such as antipsychotic drugs (chlorpromazine, clozapine) or tricyclic antidepressants.
Pregnant females, and
Ongoing cord compression or a syrinx in the spinal cord or who suffer from a spinal cord disease such as spinal stenosis, spina bifida or herniated cervical disk.

Annotated entities:
- Condition: "medical problems"
- Qualifier: "Uncontrolled"
- Condition: "pulmonary disease"
- Condition: "orthopedic disease"
- Condition: "cardiovascular disease"
- Condition: "debilitating disease"
- Temporal: "prior to the SCI"
- Condition: "exercise intolerance"
- Condition: "major depression"
- Condition: "psychosis"
- Condition: "altered cognitive status"
- Temporal: "ongoing"
- Qualifier: "Premorbid"
- Condition: "head injury"
- Condition: "stroke"
- Temporal: "History of"
- Device: "Metal plate in skull"
- Condition: "seizures"
- Drug: "drugs acting primarily on the central nervous system"
- Drug: "antipsychotic drugs"
- Qualifier: "lower the seizure threshold"
- Drug: "chlorpromazine"
- Drug: "clozapine"
- Drug: "tricyclic antidepressants"
- Condition: "Pregnant"
- Person: "females"
- Condition: "cord compression"
- Condition: "syrinx"
- Qualifier: "spinal cord"
- Condition: "spinal cord disease"
- Condition: "spinal stenosis"
- Condition: "spina bifida"
- Condition: "herniated cervical disk"
- Condition: "orthopedic disease"
- Condition: "cardiovascular disease"
- Condition: "pulmonary disease"
- Condition: "medical problems"
- Qualifier: "Uncontrolled"
- Condition: "debilitating disease"
- Condition: "exercise intolerance"
- Qualifier: "Premorbid"
- Temporal: "ongoing"
- Condition: "major depression"
- Condition: "psychosis"
- Condition: "altered cognitive status"
- Condition: "head injury"
- Condition: "stroke"
- Temporal: "History"
- Device: "Metal plate in skull"
- Condition: "seizures"
- Temporal: "History of"
- Drug: "drugs acting primarily on the central nervous system"
- Qualifier: "lower the seizure threshold"
- Drug: "antipsychotic drugs"
- Drug: "chlorpromazine"
- Drug: "clozapine"
- Drug: "tricyclic antidepressants"
- Condition: "Pregnant"
- Person: "females"
- Condition: "cord compression"
- Condition: "syrinx"
- Qualifier: "spinal cord"
- Condition: "spinal cord disease"
- Condition: "spinal stenosis"
- Condition: "spina bifida"
- Condition: "herniated cervical disk"